Clinical trial exclusion criterion:
History of severe pulmonary disease.

Annotated entities:
- Temporal: "History"
- Condition: "severe pulmonary disease"